下列何者最能鑑別蟹足腫（keloid）與增生性疤痕（hypertrophic scar）？
A. 疤痕組織鼓起的高度
B. 疤痕組織的生長是否超過原傷口的界線及是否縮小
C. 疤痕組織內肌纖維母細胞（myofibroblasts）的量
D. 是否與轉化生長因子 β（transforming growth factor β, TGF-β）所引起有關

正確答案：B. 疤痕組織的生長是否超過原傷口的界線及是否縮小